Clinical trial inclusion criterion:
Fibroscan within 6 months of Baseline/Day1 with a result of = 12.5 kPa

Annotated entities:
- Procedure: "Fibroscan"
- Temporal: "within 6 months of Baseline/Day1"
- Value: "= 12.5 kPa"